Clinical trial exclusion criterion:
Serum creatinine level > 2.0 mg/dL

Entity relations:
- Has_value("Serum creatinine level", "> 2.0 mg/dL")